Which drugs are utilized to treat amiodarone-induced thyroitoxicosis?

Amiodarone-induced thyrotoxicosis treatment includes anti-thyroid drugs and steroid therapy
Radio Iodine Treatment (RIT) may be a safe and useful method of AIT therapy in patients with low RAIU, in whom other treatment methods are contraindicated.
Lithium is a useful and safe medication for treatment of iodine-induced thyrotoxicosis caused by amiodarone.
Thyrodectomy may be necessary in presence of unresponsiveness to standard medical treatments